Clinical trial inclusion criterion:
Previously taken one or more statins

Annotated entities:
- Multiplier: "one or more"
- Drug: "statins"